Clinical trial inclusion criterion:
Life expectancy 6 weeks or greater

Annotated entities:
- Observation: "Life expectancy"
- Value: "6 weeks or greater"